Women of Caucasian origin

The above is a clinical trial inclusion criterion. Annotated with entity spans:
[Person: Women] of [Condition: Caucasian origin]